下列何者為肺部切除手術前最重要的檢查？
A. total lung capacity
B. vital capacity
C. forced expiratory volume in 1 second（FEV1）
D. expiratory reserve volume

正確答案：C. forced expiratory volume in 1 second（FEV1）